Clinical trial inclusion criterion:
Adults over 18 years of age

Annotated entities:
- Person: "Adults"
- Value: "over 18 years of age"
- Person: "age"